Clinical trial exclusion criterion:
Existing sacral pressure ulcer, undergoing a cardiac procedure, or inability to provide informed consent.

Annotated entities:
- Condition: "sacral pressure ulcer"
- Procedure: "cardiac procedure"
- Undefined_semantics: "cardiac procedure"
- Condition: "inability to provide informed consent"
- Undefined_semantics: "inability to provide informed consent"
- Non-query-able: "inability to provide informed consent"
- Subjective_judgement: "inability to provide informed consent"